下列何種抗精神病藥，比較不會造成體重過重及高血糖或高血脂症？
A. quetiapine
B. olanzapine
C. clozapine
D. ziprasidone

正確答案：D. ziprasidone